Which disorders are caused by de novo mutations in ZSWIM6?

Mutations in the solute carrier family 9, subfamily A member 6 (SLC9A6) gene, encoding the endosomal ZSWIM6 protein, are the cause of autosomal recessive acromelic frontonasal dysostosis and Leber's hereditary optic neuropathy and/or dystonia.